21天大的新生兒發高燒，被醫師懷疑為細菌性腦膜炎，下列那一個症狀最不常見？
A. 黃疸
B. 躁動哭鬧
C. 頸部僵硬
D. 活動力不佳

正確答案：C. 頸部僵硬